Cuando se realiza un procedimiento de cateterismo venoso central de inserción periférica, la enfermera ha de tener en cuenta que:
1. El catéter está listo para su uso inmediatamente después de la inserción, no necesitando más comprobaciones.
2. Es de vital importancia realizar una radiografía de tórax y/o un registro electrocardiográfico previo a su empleo.
3. Se debe realizar un electrocardiograma completo, a fin de evitar posibles complicaciones.
4. La localización de la punta del catéter solo se comprueba si se va a administrar nutrición parenteral a través del mismo.
5. Se necesita comprobar su posición mediante una radiografía de tórax y otra de abdomen.

Respuesta correcta: 2. Es de vital importancia realizar una radiografía de tórax y/o un registro electrocardiográfico previo a su empleo.